Receiving any neoadjuvant therapy,

The above is a clinical trial exclusion criterion. Annotated with entity spans:
Receiving any [Procedure: neoadjuvant therapy],